Patient whom the surgery is converted to laparotomy

The above is a clinical trial exclusion criterion. Annotated with entity spans:
Patient whom the [Procedure: surgery] is [Observation: converted to] [Procedure: laparotomy]